What is STATegra?

Stategra is a multi-omics dataset that includes measurements from up to 10 different omics technologies applied to the same biological system, namely the well-studied mouse pre-B-cell differentiation. It includes high-throughput measurements of chromatin structure, gene expression, proteomics and metabolomics, and is complemented with single-cell data.